¿Cuál de los siguientes agentes tiene un efecto vasoconstrictor?
1. Endotelina.
2. Óxido nítrico.
3. Nitrógeno.
4. Blastoestimulina.
5. Glicina.

Respuesta correcta: 1. Endotelina.